7. No Serious Cardiac,Pulmonary,Hepatic and Nephritic disease

The above is a clinical trial inclusion criterion. Annotated with entity spans:
7. [Negation: No] Serious [Condition: Cardiac,Pulmonary,Hepatic] and [Condition: Nephritic disease]